糖尿病足部病變是導致下肢截肢的主要原因，下列敘述何者錯誤？
A. 下肢的神經病變可導致足部的變形
B. 下肢動脈血流供應不足可引起間歇性跛行（intermittent claudication）
C. 足部潰瘍經常伴隨細菌感染，因血糖控制不良，最常見的菌種為克雷伯氏肺炎桿菌（Klebsiella pneumoniae）
D. 如果感染沒有適當控制，可引起骨髓發炎

正確答案：C. 足部潰瘍經常伴隨細菌感染，因血糖控制不良，最常見的菌種為克雷伯氏肺炎桿菌（Klebsiella pneumoniae）